下列那一項麻醉劑會增加顱內壓？
A. Thiopental
B. Fentanyl
C. Ketamine
D. Etomidate

正確答案：C. Ketamine